En el trastorno obsesivo-compulsivo las compulsiones:
1. No causan malestar al individuo.
2. No llevan mucho tiempo de realización (menos de una hora al día).
3. Son comportamientos o actos mentales conectados de manera realista al objetivo de neutralizar la situación temida.
4. Son comportamientos a actos mentales cuyo objetivo es prevenir o disminuir la ansiedad.
5. Son independientes del tipo de obsesión padecida.

Respuesta correcta: 4. Son comportamientos a actos mentales cuyo objetivo es prevenir o disminuir la ansiedad.